Clinical trial exclusion criteria:
Presence of another vaginal infection or STD
Allergy to metronidazole
Pregnant or nursing
Use of oral or intravaginal antibiotics within the past 2 weeks
HIV or other chronic disease
Inability to keep return appointments
Contraindications for Lactobacillus Vaginal Suppositories(those without sexual history)

Annotated entities:
- Condition: "vaginal infection"
- Qualifier: "another"
- Condition: "STD"
- Condition: "Allergy"
- Drug: "metronidazole"
- Condition: "Pregnant"
- Condition: "nursing"
- Drug: "intravaginal antibiotics"
- Drug: "oral antibiotics"
- Temporal: "within the past 2 weeks"
- Condition: "HIV"
- Qualifier: "other"
- Condition: "chronic disease"
- Observation: "Inability to keep return appointments"
- Condition: "Contraindications"
- Drug: "Lactobacillus Vaginal Suppositories"
- Negation: "without"
- Temporal: "sexual history"